50 歲女性罹患乳腺浸潤性管道腺癌（infiltrating ductal carcinoma），腫瘤大小為 1.2 公分，腋下淋巴結清除為 16 顆，其中 1 顆轉移，其他檢查未發現遠端轉移，則此病患依據 AJCC（American Joint  Committee on Cancer）癌症分期為第幾期？（T:Tumor, N:Node, M:Metastasis, p:pathological）
A. pT1aN0M0，Stage I A
B. pT1bN1M0，Stage I B
C. pT1cN1M0，Stage II A
D. pT1cN1M0，Stage II B

正確答案：C. pT1cN1M0，Stage II A